Clinical trial exclusion criteria:
current or recent (within one week of surgery) systemic antibiotic use, intolerance to both clindamycin and cephalexin, discovery of a persistent cutaneous malignancy at the site of the defect following the reconstructive procedure and previous reconstruction at the site of the skin/soft-tissue defect.

Annotated entities:
- Drug: "antibiotic"
- Condition: "intolerance"
- Drug: "clindamycin"
- Drug: "cephalexin"
- Condition: "persistent cutaneous malignancy"
- Qualifier: "site of the defect"
- Temporal: "following the reconstructive procedure"
- Reference_point: "the reconstructive procedure"
- Procedure: "reconstructive procedure"
- Temporal: "within one week of surgery"
- Temporal: "recent"
- Temporal: "current"